肢體末梢神經對稱性感覺喪失最可能發生在下列何種疾病的患者？
A. cerebellar lesions
B. cerebrovascular diseases
C. diabetic polyneuropathy
D. Parkinson's disease

正確答案：C. diabetic polyneuropathy